檢查新型隱球菌（Cryptococcus neoformans）感染常用何種染色方法？
A. 革蘭氏染色法（Gram staining）
B. 抗酸染色法（acid-fast staining）
C. 鍍銀染色法（silver staining）
D. 墨汁染色法（india ink staining）

正確答案：D. 墨汁染色法（india ink staining）